Una paciente presenta una larga historia de múltiples síntomas físicos: pérdida de memoria, dolor de cabeza, mareos, vómitos, dolor genital, dolor en extremidades, distensión abdominal e irregularidades menstruales. Los diversos exámenes médicos han descartado enfermedad médica alguna. ¿Cuál de los siguientes cuadros es más probable que padezca?
1. Trastorno conversivo.
2. Trastorno hipocondríaco.
3. Trastorno de somatización.
4. Trastorno disociativo.

Respuesta correcta: 3. Trastorno de somatización.